Abnormalities in which chromosomes were linked to the Moyamoya disease?

chromosomes 3, 6, 8, 12, 15, 17, 21, X and Y were implicated in the Moyamoya disease.